下列那一種藥物會減少 levodopa 在週邊系統被 decarboxylase 代謝？
A. amantadine
B. deprenyl
C. carbidopa
D. bromocriptine

正確答案：C. carbidopa